Es una expresión característica de una persona con alta motivación de logro:
1. “Espero poco de los demás”.
2. “La originalidad no me preocupa”.
3. “Prefiero tareas de gran dificultad”.
4. “Los éxitos son debidos normalmente a mi esfuerzo”.
5. “Tengo el pensamiento divergente poco desarrollado”.

Respuesta correcta: 4. “Los éxitos son debidos normalmente a mi esfuerzo”.